All subjects will be in good general health and able to participate in the LP and imaging exams. This determination is made by the study neurologist and reviewed at a consensus meeting for each subject.

The above is a clinical trial inclusion criterion. Annotated with entity spans:
All subjects will be in [Condition: good general health] and [Observation: able to participate] in the [Procedure: LP] and [Procedure: imaging exams]. [Non-representable: This determination is made by the study neurologist and reviewed at a consensus meeting for each subject.]